Clinical trial exclusion criterion:
Uncontrolled ventricular arrhythmia

Annotated entities:
- Condition: "ventricular arrhythmia"
- Qualifier: "Uncontrolled"